Clinical trial exclusion criterion:
patients' refusal

Annotated entities:
- Post-eligibility: "patients' refusal"